Clinical trial inclusion criterion:
1. Women of childbearing potential must have negative serum (Beta HCG) pregnancy tests performed within 14 days prior to the start of the study and on the evening prior to each dose administration. If dosing is scheduled on Sunday or Monday, the HCG pregnancy test should be given within 48 hours prior to dosing of each study period. An additional serum (Beta HCG) pregnancy test will be performed upon completion of the study.

Entity relations:
- Subsumes("serum pregnancy tests", "Beta HCG")
- Has_value("serum pregnancy tests", "negative")
- Has_index("within 14 days prior to the start of the study", "the start of the study")
- Has_temporal("serum pregnancy tests", "within 14 days prior to the start of the study")
- Has_index("on the evening prior to each dose administration", "each dose administration")
- Has_temporal("serum pregnancy tests", "on the evening prior to each dose administration")
- AND("Women", "serum pregnancy tests")
- AND("Women", "childbearing potential")